Describe LowMACA

LowMACA is a software that combines the mutations of various proteins sharing the same domains to identify conserved residues that harbor clustered mutations in multiple sequence alignments.